Clinical trial exclusion criterion:
Current treatment with weekly individual or group psychotherapy of any type targeted at depressive symptoms.

Entity relations:
- Has_qualifier("psychotherapy", "individual")
- Has_multiplier("psychotherapy", "weekly")
- AND("psychotherapy", "depressive symptoms")
- OR("individual", "group")